Clinical trial inclusion criterion:
(3)Voluntarily continues to participate in this study.

Entity relations:
- Has_qualifier("continues to participate in this study", "Voluntarily")